Clinical trial exclusion criterion:
Severe coagulation disorder: prothrombin time <40% (or INR >1.7) or platelet count <30,000/mm3

Annotated entities:
- Condition: "coagulation disorder"
- Qualifier: "Severe"
- Measurement: "prothrombin time"
- Value: "<40%"
- Measurement: "INR"
- Value: ">1.7"
- Measurement: "platelet count"
- Value: "<30,000/mm3"